Recent participation (within 28 days) in other research studies

The above is a clinical trial exclusion criterion. Annotated with entity spans:
[Context_Error: Recent participation (within 28 days) in other research studies]